Clinical trial inclusion criterion:
3. Right heart catheterization performed at Screening with results that are:

Entity relations:
- Has_index("performed at Screening", "Screening")
- Has_temporal("Right heart catheterization", "performed at Screening")